Clinical trial inclusion criterion:
Ovarian Reserve: number of antral follicles 2 millimeter (mm) between 6 <= antral follicle count (AFC) <= 16

Entity relations:
- Has_value("number of antral follicles 2 millimeter (mm)", "between 6 <= antral follicle count (AFC) <= 16")